Clinical trial exclusion criterion:
IIEF < 21

Entity relations:
- Has_value("IIEF", "< 21")